Clinical trial exclusion criterion:
History or other evidence of bleeding from esophageal varices or other conditions consistent with decompensated liver disease.

Annotated entities:
- Condition: "bleeding"
- Condition: "esophageal varices"
- Qualifier: "other"
- Condition: "conditions consistent with decompensated liver disease"